Normal bone marrow reserve function and normal liver, kidney function

The above is a clinical trial inclusion criterion. Annotated with entity spans:
[Value: Normal] [Measurement: bone marrow reserve function] and [Value: normal] [Measurement: liver], [Measurement: kidney function]